In which fields of DNA sequencing are Bloom filters applied?

A novel algorithm, fast and accurate classification of sequences (FACSs), is introduced that can accurately and rapidly classify sequences as belonging or not belonging to a reference sequence.  Classification of DNA sequences using Bloom filters Lighter is a fast, memory-efficient tool for correcting sequencing errors.